What is the role of 5hmC (5 hydroxy-methyl-Cytocine) in differentiation?

Dynamic hydroxymethylation of deoxyribonucleic acid marks differentiation-associated enhancers